Recent blood donation

The above is a clinical trial exclusion criterion. Annotated with entity spans:
Recent [Observation: blood donation]